What impacts stability of genomic imprinting in mouse pluripotent stem cells?

A susceptibility locus on chromosome 13 profoundly impacts the stability of genomic imprinting in mouse pluripotent stem cells.